下肢開放性骨折，若有需要做血管修補的時候，屬於 Gustilo 分類的第幾類？
A. type I
B. type II
C. type III A
D. type III C

正確答案：D. type III C